patients with child class B and C liver disease

The above is a clinical trial exclusion criterion. Annotated with entity spans:
patients with [Measurement: child class] [Value: B] and [Value: C] [Condition: liver disease]